Previous pelvic or abdominal radiotherapy

The above is a clinical trial exclusion criterion. Annotated with entity spans:
[Temporal: Previous] [Procedure: pelvic] or [Procedure: abdominal radiotherapy]